Clinical trial exclusion criterion:
Inability or unwillingness to complete questionnaires

Annotated entities:
- Observation: "unwillingness to complete questionnaires"
- Observation: "Inability to complete questionnaires"